下列有關粒線體之敘述何者錯誤？
A. 粒線體以分裂方式（division）增加數目
B. 粒線體之基質（matrix）具有DNA與RNA
C. 粒線體之基質顆粒（matrix granules）可儲存雙價離子
D. 粒線體具單層膜

正確答案：D. 粒線體具單層膜